Clinical trial inclusion criterion:
Male & female patients >= 18 and < 70 years of age

Entity relations:
- Has_value("age", ">= 18 and < 70 years")
- OR("Male", "female")